Intracranial hemorrhage in anamnesis

The above is a clinical trial exclusion criterion. Annotated with entity spans:
[Condition: Intracranial hemorrhage] in [Procedure: anamnesis]